Sepsis

The above is a clinical trial inclusion criterion. Annotated with entity spans:
[Condition: Sepsis]